Clinical trial exclusion criterion:
previous gastrointestinal surgery

Annotated entities:
- Procedure: "gastrointestinal surgery"